Clinical trial inclusion criteria:
18-year or older patients
Patient hospitalized in neuro-critical care for:
Arachnoid hemorrhage
Intra parenchymatous hematoma
stroke
Acute brain Severe injury
Post-operative complication of an act of neurosurgery or programmed neuroradiology
Sedation and mechanical ventilation planned > 2 days
Monitoring of intracranial temperature and pressure by intraparenchymal sensor (Sophysa®)
Brain temperature > 38.5°C for more than 30 minutes

Annotated entities:
- Value: "18-year or older"
- Person: "old"
- Visit: "hospitalized"
- Visit: "neuro-critical care"
- Condition: "Arachnoid hemorrhage"
- Qualifier: "Intra parenchymatous"
- Condition: "hematoma"
- Condition: "stroke"
- Condition: "Acute brain Severe injury"
- Condition: "Post-operative complication"
- Procedure: "neurosurgery"
- Qualifier: "of an act of neurosurgery"
- Procedure: "neuroradiology"
- Qualifier: "of an act of programmed neuroradiology"
- Procedure: "mechanical ventilation"
- Procedure: "Sedation"
- Temporal: "> 2 days"
- Mood: "planned"
- Measurement: "intracranial temperature"
- Measurement: "intracranial pressure"
- Device: "intraparenchymal sensor"
- Device: "Sophysa®"
- Measurement: "Brain temperature"
- Value: "> 38.5°C"
- Temporal: "for more than 30 minutes"